關於乳糜胸之敘述，何者正確？
A. 最常發生在左側胸腔
B. 最常因為腫瘤造成乳糜胸
C. 不管乳糜胸引流量多寡，結紮胸管手術是治療乳糜胸唯一方式
D. 假性乳糜胸通常由於類風濕肋膜炎或結核所致

正確答案：D. 假性乳糜胸通常由於類風濕肋膜炎或結核所致